Clinical trial inclusion criterion:
3. impaired glucose homeostasis (fasting plasma glucose concentration of 110 mg⁄dL or greater or glucose of 140 mg⁄dL or greater after OGTT or

Entity relations:
- Has_value("fasting plasma glucose concentration", "110 mg⁄dL or greater")
- multi("after OGTT", "OGTT")
- multi("OGTT", "OGTT")
- Has_value("glucose", "140 mg⁄dL or greater")
- multi("after OGTT", "after OGTT")
- Has_qualifier("glucose", "after OGTT")
- Subsumes("impaired glucose homeostasis", "fasting plasma glucose concentration")
- OR("fasting plasma glucose concentration", "glucose")